Clinical trial inclusion criterion:
Subject has confirmed Pulmonary Hypertension and Interstitial Lung Disease

Annotated entities:
- Condition: "Pulmonary Hypertension"
- Condition: "Interstitial Lung Disease"
- Mood: "confirmed"